下列遺傳或染色體疾病與其好發先天性心臟病之相關組合，何者最不可能？
A. Down syndrome - endocardial cushion defect
B. Turner syndrome - bicuspid aortic valve
C. DiGeorge syndrome -interrupted aortic arch
D. Williams syndrome - aortic root dilatation/regurgitation

正確答案：D. Williams syndrome - aortic root dilatation/regurgitation